Clinical trial exclusion criteria:
Anaphylactic reaction to a previous dose of influenza vaccine or to any of its components
Known Immunoglobulin E (IgE)-mediated hypersensitivity to eggs manifested as hives, swelling of the mouth and throat, difficulty in breathing, hypotension, or shock
Guillain- Barré syndrome within eight weeks of a previous influenza vaccine
Use of aspirin or salicylate- containing products within 30 days before enrollment
Household members of children in Group A

Annotated entities:
- Condition: "Anaphylactic reaction"
- Temporal: "previous"
- Drug: "influenza vaccine"
- Drug: "its components"
- Condition: "Immunoglobulin E (IgE)-mediated hypersensitivity"
- Drug: "eggs"
- Condition: "hives"
- Condition: "swelling of the mouth"
- Condition: "swelling of the throat"
- Condition: "difficulty in breathing"
- Condition: "hypotension"
- Condition: "shock"
- Condition: "Guillain- Barré syndrome"
- Temporal: "within eight weeks of a previous influenza vaccine"
- Reference_point: "a previous influenza vaccine"
- Temporal: "previous"
- Drug: "influenza vaccine"
- Drug: "aspirin"
- Drug: "salicylate- containing products"
- Temporal: "within 30 days before enrollment"
- Person: "Household members"
- Person: "children"
- Person: "Group A"